Clinical trial exclusion criterion:
Any intraocular surgery in the study eye within the last 90 days prior to study enrollment.

Annotated entities:
- Procedure: "intraocular surgery"
- Qualifier: "in the study eye"
- Temporal: "within the last 90 days prior to study enrollment"
- Reference_point: "study enrollment"